Clinical trial exclusion criterion:
life expectancy less than 2 years;

Entity relations:
- Has_value("life expectancy", "less than 2 years")